Clinical trial exclusion criterion:
Diabetes mellitus

Annotated entities:
- Condition: "Diabetes mellitus"